Clinical trial exclusion criteria:
Patients with liver cirrhosis, Hepatocellular Carcinoma or other malignancies.
Patients with other factors causing liver diseases.
Pregnant and lactating women.
Patients with concomitant HIV infection or congenital immune deficiency diseases.
Patients with diabetes, autoimmune diseases.
Patients with important organ dysfunctions.
Patients with serious complications (e.g., infection, hepatic encephalopathy, hepatorenal syndrome, gastrointestinal bleeding.)
Patients who receive antineoplastic or immunomodulatory therapy in the past 12 months.
Patients who can't come back to clinic for follow-up on schedule.

Annotated entities:
- Condition: "liver cirrhosis"
- Condition: "Hepatocellular Carcinoma"
- Condition: "malignancies"
- Non-representable: "Patients with other factors causing liver diseases"
- Pregnancy_considerations: "Pregnant and lactating women"
- Condition: "HIV infection"
- Qualifier: "concomitant"
- Condition: "congenital immune deficiency diseases."
- Condition: "diabetes"
- Condition: "autoimmune diseases"
- Condition: "organ dysfunctions"
- Qualifier: "serious"
- Condition: "complications"
- Condition: "infection"
- Condition: "hepatic encephalopathy"
- Condition: "hepatorenal syndrome"
- Condition: "gastrointestinal bleeding"
- Procedure: "antineoplastic therapy"
- Procedure: "immunomodulatory therapy"
- Temporal: "past 12 months"
- Post-eligibility: "Patients who can't come back to clinic for follow-up on schedule"